Clinical trial exclusion criterion:
History of alcohol abuse (defined as average intake of three or more units of alcohol per day) within 5 years of the Screening Visit.

Entity relations:
- Has_temporal("alcohol abuse", "History")
- Has_multiplier("alcohol", "three or more units per day")
- Subsumes("alcohol abuse", "alcohol")
- Has_index("within 5 years of the Screening Visit", "the Screening Visit")